Clinical trial exclusion criterion:
Type I or II diabetes

Entity relations:
- OR("Type II diabetes", "Type I diabetes")